腦軟化（encephalomalacia）是指：
A. 死後自溶變化，整個腦成泥粥狀
B. 局部缺血區液化或空洞
C. 新生兒髓鞘形成不良
D. 成人髓鞘瀰漫性破壞

正確答案：B. 局部缺血區液化或空洞